Clinical trial exclusion criterion:
Blood donation within 60 days prior to screening or intent to donate within 60 days after Final Study Visit.

Annotated entities:
- Procedure: "Blood donation"
- Temporal: "within 60 days prior to screening"
- Reference_point: "screening"
- Observation: "intent to donate"
- Non-query-able: "intent to donate"
- Temporal: "within 60 days after Final Study Visit"
- Reference_point: "Final Study Visit"